Clinical trial exclusion criterion:
9. Diabetes agents: glibenclamide, glyburide

Annotated entities:
- Parsing_Error: "9."
- Drug: "glibenclamide"
- Drug: "glyburide"